What is hypercapnia?

Hypercapnia is also known as High CO2 retention.